當嬰幼兒因為外傷被帶至急診時，下列照顧者的敘述何者最合理？
A. 2個月的嬰兒自己翻身掉到床下撞到頭部
B. 4個月大的嬰兒腳卡到床欄，在自行掙脫的過程中讓大腿骨折
C. 5個月的嬰兒爬行時自己碰到熨斗而燙到手
D. 1歲2個月的嬰兒抓到餐桌的桌巾，讓桌上熱湯翻下燙傷臉部

正確答案：D. 1歲2個月的嬰兒抓到餐桌的桌巾，讓桌上熱湯翻下燙傷臉部